Clinical trial exclusion criterion:
Subject has any untreated or uncontrolled hyperthyroidism or hypothyroidism.

Annotated entities:
- Condition: "hyperthyroidism"
- Condition: "hypothyroidism"
- Qualifier: "untreated"
- Qualifier: "uncontrolled"